Un hombre con miopía magna, de 47 años, intervenido de cataratas hace 2 años, acude a urgencias refiriendo una pérdida profunda e indolora de visión en su ojo derecho. ¿Cuál de los siguientes diagnósticos puede provocar esta sintomatología?
1. Endoftalmitis postquirúrgica.
2. Desprendimiento de retina.
3. Degeneración macular asociada a la edad, forma húmeda.
4. Desprendimiento posterior de vítreo.

Respuesta correcta: 2. Desprendimiento de retina.